Clinical trial exclusion criterion:
patients with unilateral or bilateral nephrectomy

Entity relations:
- Has_qualifier("nephrectomy", "unilateral")
- OR("unilateral", "bilateral")